服用 captopril 藥物後，最常見的副作用是什麼？
A. 鎮靜
B. 乾咳
C. 低血壓
D. 心悸

正確答案：B. 乾咳